Señale a cuál de las siguientes orientaciones pertenece el Programa de Reducción de Estrés de Kabat–Zinn (Universidad de Massachusetts):
1. Terapia de aceptación y compromiso.
2. Terapia de activación conductual.
3. Psicoeducación y mindlfulness.
4. Terapia dialéctica.
5. Terapia de factores comunes.

Respuesta correcta: 3. Psicoeducación y mindlfulness.